Clinical trial exclusion criterion:
Having comorbid psychiatric conditions according to the criteria set forth in the DSM-IV(administered by the Mini-International Neuropsychiatric Interview (MINI))

Entity relations:
- Has_qualifier("psychiatric conditions", "comorbid")
- Has_qualifier("psychiatric conditions", "DSM-IV")